Clinical trial exclusion criterion:
Anatomical abnormalities preventing successful peripheral catheter insertion

Annotated entities:
- Condition: "Anatomical abnormalities"
- Qualifier: "successful"
- Mood: "preventing"
- Device: "peripheral catheter"
- Procedure: "insertion"
- Negation: "preventing"